adult patients

The above is a clinical trial inclusion criterion. Annotated with entity spans:
[Person: adult] patients